Blood glucose levels between >140 mg and <400 mg/dL without laboratory evidence of diabetic ketoacidosis

The above is a clinical trial inclusion criterion. Annotated with entity spans:
[Measurement: Blood glucose levels] between [Value: >140 mg and <400 mg/dL] [Negation: without] [Qualifier: laboratory evidence] of [Condition: diabetic ketoacidosis]